有關治療癌症疼痛之方法的敘述，下列何者錯誤？
A. 根據 WHO 止痛階梯（analgesic ladder），止痛藥物之選擇，乃依病痛之嚴重程度由弱至強來使用
B. 病人自控止痛藥是目前最方便、最簡單之方法
C. 輔助藥劑包括有鎮定劑、安眠劑、止吐劑、軟便劑、類固醇、抗焦慮及憂鬱劑、抗癲癇劑等
D. 神經破壞術（neurolytic block）在某些情況下可有效解除局部之疼痛，而減少了止痛藥之劑量

正確答案：B. 病人自控止痛藥是目前最方便、最簡單之方法